Clinical trial inclusion criterion:
Stable psychiatric medications and doses for the month prior to enrollment. Subjects may continue to engage in any ongoing psychotherapy.

Annotated entities:
- Qualifier: "Stable"
- Drug: "psychiatric medications"
- Multiplier: "Stable doses"
- Temporal: "for the month prior to enrollment"
- Reference_point: "enrollment"
- Non-representable: "Subjects may continue to engage in any ongoing psychotherapy."